Which genes are the main markers of primitive Endoderm (prEN) formation?

The main markers of primitive Endoderm (prEN) formation are fgf4, lrp2, gata4, pdgfra, pDgfrα, gATA6, nanog, p dgfralpha, egam1 and dab2.